Any other illness or infection (latent or active) that, in the Investigator's opinion, could be exacerbated by study medication

The above is a clinical trial exclusion criterion. Annotated with entity spans:
Any other [Condition: illness] or [Condition: infection] ([Qualifier: latent] or [Qualifier: active]) that, [Non-representable: in the Investigator's opinion], could be [Qualifier: exacerbated by study medication]